下列何者最有可能是初級醛固酮分泌過量（primary hyperaldosteronism）病人容易產生的症狀？
A. 葡萄糖耐受性不良
B. 血中鈉離子流失
C. 低血壓
D. 血脂濃度下降

正確答案：A. 葡萄糖耐受性不良